下列何種神經再生最佳？
A. 單純運動神經
B. 感覺神經
C. 混合型神經（mixed nerve）
D. 各個部位的神經不一定

正確答案：A. 單純運動神經